Clinical trial exclusion criterion:
Use of drugs that might have enhanced or inhibited CYP3A4 or P-gp activity

Annotated entities:
- Non-query-able: "Use of drugs that might have enhanced or inhibited CYP3A4 or P-gp activity"